Clinical trial exclusion criterion:
Use of any prohibited concomitant medications within 30 days of the Baseline/Day 1 visit.

Annotated entities:
- Post-eligibility: "Use of any prohibited concomitant medications within 30 days of the Baseline/Day 1 visit."